Clinical trial exclusion criterion:
Female subjects who are pregnant or lactating

Annotated entities:
- Person: "Female"
- Condition: "pregnant"
- Condition: "lactating"